Clinical trial exclusion criterion:
Serum creatinine level = 3.0 mg/dL

Entity relations:
- Has_value("Serum creatinine level", "= 3.0 mg/dL")